Clinical trial exclusion criterion:
right sided hemicolectomy

Annotated entities:
- Procedure: "right sided hemicolectomy"